Patients with a self-described allergy to ASA, acetaminophen, NSAIDS and codeine.

The above is a clinical trial exclusion criterion. Annotated with entity spans:
Patients with a self-described [Condition: allergy] to [Drug: ASA], [Drug: acetaminophen], [Drug: NSAIDS] and [Drug: codeine].